Clinical trial inclusion criterion:
ASA 1 or2.

Annotated entities:
- Measurement: "ASA"
- Value: "1 or2"